Clinical trial inclusion criterion:
Active LN with proteinuria (urine protein/creatinine ratio >1.0 or 24-hr urine protein >1.0 g at baseline), with or without hematuria.

Entity relations:
- Has_value("urine protein/creatinine ratio", ">1.0")
- Has_value("24-hr urine protein", ">1.0 g")
- Subsumes("proteinuria", "urine protein/creatinine ratio")
- AND("LN", "proteinuria")
- Has_qualifier("LN", "Active")
- OR("urine protein/creatinine ratio", "24-hr urine protein")